鈉碘共同運輸子（Na+- I- symporter，NIS）的功能為何？
A. 將碘離子由單碘酪胺酸（MIT）解離
B. 將碘離子與酪胺酸結合
C. 將單碘酪胺酸與甲狀腺球蛋白分離
D. 將碘離子運輸進入甲狀腺上皮細胞

正確答案：D. 將碘離子運輸進入甲狀腺上皮細胞